Las tetraciclinas actúan sobre la:
1. DNA polimerasa.
2. Transpeptidación del péptidoglicano de la pared.
3. RNA polimeras.
4. Subunidad 30S del ribosoma.
5. DNA girasa.

Respuesta correcta: 4. Subunidad 30S del ribosoma.